Clinical trial exclusion criterion:
Women with previous SLNBx or axillary node dissection

Entity relations:
- Has_qualifier("SLNBx", "previous")
- OR("SLNBx", "axillary node dissection")